Clinical trial exclusion criterion:
Pregnancy or possible pregnancy at time of randomization, or female of child bearing potential who are lactating, or sexually active and not taking adequate contraceptive precautions (e.g., intrauterine device or oral contraceptives for 3 months prior to entry into the study)

Annotated entities:
- Condition: "Pregnancy"
- Mood: "possible"
- Condition: "pregnancy"
- Temporal: "at time of randomization"
- Reference_point: "time of randomization"
- Person: "female"
- Observation: "child bearing potential"
- Observation: "lactating"
- Observation: "sexually active"
- Negation: "not"
- Qualifier: "adequate"
- Observation: "contraceptive precautions"
- Device: "intrauterine device"
- Drug: "oral contraceptives"
- Temporal: "for 3 months prior to entry into the study"
- Reference_point: "entry into the study"